Clinical trial exclusion criterion:
Requirement for renal support (either continuous or discontinuous techniques, including intermittent haemodialysis, haemofiltration and haemodiafiltration)

Entity relations:
- Has_mood("renal support", "Requirement for")